Clinical trial exclusion criterion:
hematology diseases

Annotated entities:
- Condition: "hematology diseases"